Clinical trial exclusion criterion:
Patient is expecting or has had major cardiac surgery within last two months.

Entity relations:
- Has_temporal("major cardiac surgery", "last two months")